Clinical trial exclusion criterion:
History of having received any systemic anti-neoplastic (including radiation) or immunomodulatory treatment (including systemic corticosteroids) <=6 months prior to the first dose of study drug or the expectation that such treatment will be needed at any time during the study.

Annotated entities:
- Qualifier: "systemic"
- Procedure: "anti-neoplastic treatment"
- Procedure: "immunomodulatory treatment"
- Procedure: "radiation"
- Qualifier: "systemic"
- Drug: "corticosteroids"
- Temporal: "<=6 months prior to the first dose of study drug"
- Reference_point: "the first dose of study drug"
- Mood: "expectation"
- Procedure: "treatment"
- Mood: "will be needed"
- Temporal: "at any time during the study"